Clinical trial inclusion criterion:
Negative pregnancy test (blood ß-HCG dosage)

Entity relations:
- Has_value("pregnancy test", "Negative")
- Subsumes("pregnancy test", "blood ß-HCG dosage")